The receipt of any investigational product within 3 months prior to this trial

The above is a clinical trial exclusion criterion. Annotated with entity spans:
The receipt of any [Drug: investigational product] [Temporal: within 3 months prior to this trial]